Clinical trial exclusion criterion:
The patients have bilateral breast cancers or DCIS or metastatic breast cancers.

Annotated entities:
- Condition: "bilateral breast cancers"
- Condition: "DCIS"
- Condition: "metastatic breast cancers"